在使用人工心臟瓣膜的病人，出現胃腸出血，必需先考慮何種原因所引起？
A. 使用抗凝血藥物
B. 再生不良性貧血
C. 自體免疫性血小板缺乏症
D. 血小板減少性紫斑

正確答案：A. 使用抗凝血藥物